interstitial cystitis

The above is a clinical trial exclusion criterion. Annotated with entity spans:
[Condition: interstitial cystitis]